Clinical trial exclusion criterion:
Uncontrolled narrow-angle glaucoma

Entity relations:
- Has_qualifier("narrow-angle glaucoma", "Uncontrolled")